Clinical trial exclusion criterion:
With severe systemic alteration;

Annotated entities:
- Condition: "systemic alteration"
- Qualifier: "severe"